Which database exists that contains regulatory sites for splicing in human basal ganglia?

Braineacv2 has been identified as a database that contains regulatory sites for splicing in human basal ganglia.